在 DSM-IV-TR 的診斷系統中，共有三大類人格違常疾患。其中，C 型人格違常疾患常表現出焦慮或害怕的情緒，下列何者不屬於 C 型人格違常？
A. 強迫性人格違常（obsessive-compulsive personality disorder）
B. 依賴性人格違常（dependent personality disorder）
C. 邊緣性人格違常（borderline personality disorder）
D. 逃避性人格違常（avoidant personality disorder）

正確答案：C. 邊緣性人格違常（borderline personality disorder）